Clinical trial exclusion criterion:
Patients that have had a high tibial osteotomy or femoral osteotomy

Entity relations:
- OR("high tibial osteotomy", "femoral osteotomy")